Exclusion Criteria: coronary artery disease, diabetes mellitus, contraindications to cardiac magnetic resonance imaging (CMR), weight >350 lbs, inability to lie flat for imaging, anemia, contraindications to regadenoson or aminophylline

The above is a clinical trial exclusion criterion. Annotated with entity spans:
Exclusion Criteria: [Condition: coronary artery disease], [Condition: diabetes mellitus], [Condition: contraindications] to [Procedure: cardiac magnetic resonance imaging (CMR)], [Measurement: weight] [Value: >350 lbs], [Observation: inability to lie flat for imaging], [Condition: anemia], [Condition: contraindications] to [Drug: regadenoson] or [Drug: aminophylline]